evaluated for an STI within 6 months prior to screening

The above is a clinical trial inclusion criterion. Annotated with entity spans:
[Procedure: evaluated for an STI] [Temporal: within 6 months prior to screening]